What is Chrysophanol?

Chrysophanol is an anthraquinone compound, which exhibits anticancer effects on certain types of cancer cells